Clinical trial inclusion criterion:
The patient has a confirmed GAA enzyme deficiency from skin, blood, or muscle tissue and/or 2 confirmed GAA gene mutations.

Annotated entities:
- Condition: "GAA enzyme deficiency"
- Qualifier: "skin"
- Qualifier: "blood"
- Qualifier: "muscle tissue"
- Multiplier: "2"
- Observation: "GAA gene mutations"